Clinical trial exclusion criterion:
Liver dysfunction and elevated Liver Function Tests (LFTs)

Entity relations:
- Subsumes("Liver Function Tests", "LFTs")
- Has_value("Liver Function Tests", "elevated")